Clinical trial inclusion criterion:
Current treatment with glycoproteins IIb-IIIa inhibitors

Entity relations:
- Has_temporal("treatment", "Current")
- AND("treatment", "glycoproteins IIb-IIIa inhibitors")